Uncontrolled Type II diabetes mellitus (Hemaglobin subtype A1C (HbA1C) >11 %)

The above is a clinical trial exclusion criterion. Annotated with entity spans:
[Qualifier: Uncontrolled] [Condition: Type II diabetes mellitus] ([Measurement: Hemaglobin subtype A1C (HbA1C)] [Value: >11 %])